Clinical trial inclusion criterion:
Age: ≥18 and ≤ 60

Entity relations:
- Has_value("Age", "≥18 and ≤ 60")